Clinical trial inclusion criterion:
Age > 18 years

Entity relations:
- Has_value("Age", "> 18 years")